Clinical trial exclusion criterion:
Central nervous system (CNS) metastases or prior radiation for CNS metastases

Entity relations:
- AND("radiation", "CNS metastases")
- OR("Central nervous system (CNS) metastases", "radiation")